Clinical trial inclusion criterion:
chronic renal insufficiency requiring dialysis

Entity relations:
- AND("chronic renal insufficiency", "dialysis")